Clinical trial inclusion criteria:
1. Signed informed consent
2. Healthy subjects aged between 18 years and 45 years inclusive
3. Weighing at least 50 kg
4. Volunteers must be hospitalized on Days 1-4, 7-9, and 17-20 for pharmacokinetic assessments for each biomarker and TPV/r (Days 7-9 and 17-20)
5. Volunteers must be willing to complete all study-related activities
6. Each volunteer must have a valid social security number
7. Each volunteer must have acceptable medical history, physical examination and laboratory test

Annotated entities:
- Parsing_Error: "1."
- Post-eligibility: "Signed informed consent"
- Non-query-able: "Signed informed consent"
- Parsing_Error: "2."
- Person: "aged"
- Value: "between 18 years and 45 years inclusive"
- Condition: "Healthy"
- Parsing_Error: "3."
- Measurement: "Weighing"
- Value: "at least 50 kg"
- Parsing_Error: "4."
- Not_a_criteria: "Volunteers must be hospitalized on Days 1-4, 7-9, and 17-20 for pharmacokinetic assessments for each biomarker and TPV/r (Days 7-9 and 17-20)"
- Post-eligibility: "Volunteers must be hospitalized on Days 1-4, 7-9, and 17-20 for pharmacokinetic assessments for each biomarker and TPV/r (Days 7-9 and 17-20)"
- Parsing_Error: "5."
- Post-eligibility: "Volunteers must be willing to complete all study-related activities"
- Non-query-able: "Volunteers must be willing to complete all study-related activities"
- Parsing_Error: "6."
- Post-eligibility: "Each volunteer must have a valid social security number"
- Non-query-able: "Each volunteer must have a valid social security number"
- Parsing_Error: "7."
- Temporal: "medical history"
- Procedure: "physical examination"
- Measurement: "laboratory test"
- Undefined_semantics: "medical history, physical examination and laboratory test"
- Post-eligibility: "Each volunteer must have acceptable medical history, physical examination and laboratory test"